Emergency operation

The above is a clinical trial exclusion criterion. Annotated with entity spans:
[Qualifier: Emergency] [Procedure: operation]